Clinical trial exclusion criterion:
Patients with uncontrolled congestive heart failure (NYHA Class IV)

Entity relations:
- Has_value("NYHA", "Class IV")
- Has_qualifier("congestive heart failure", "uncontrolled")
- Subsumes("congestive heart failure", "NYHA")